Culture result consistent with MDR gram negative for this febrile neutropenic episode.

The above is a clinical trial inclusion criterion. Annotated with entity spans:
Culture result consistent with [Qualifier: MDR] [Condition: gram negative] for this febrile neutropenic episode.